Clinical trial exclusion criterion:
Side effects taking longer than 2 weeks to present.

Annotated entities:
- Non-query-able: "Side effects taking longer than 2 weeks to present"